抑制子宮收縮以阻止早產的類固醇主要為下列那一項？
A. 助孕素（Progesterone）
B. 雌激素（Estrogen）
C. 雄性素（Androgen）
D. 皮質醇（Cortisol）

正確答案：A. 助孕素（Progesterone）